Clinical trial inclusion criterion:
Adult patients (age = 18)

Entity relations:
- Has_value("age", "= 18")
- Subsumes("Adult", "age")